Clinical trial inclusion criterion:
On multiple daily insulin injections, including basal long-acting insulin and rapid-acting insulin before each meal.

Entity relations:
- Has_qualifier("insulin", "daily")
- Has_qualifier("insulin", "basal long-acting")
- Has_qualifier("insulin", "rapid-acting")
- Subsumes("insulin", "insulin")
- Subsumes("insulin", "insulin")